Clinical trial inclusion criterion:
Post-procedural residual diameter stenosis of the treated lesions < 20% in patients with stent implantation or < 50% in those with balloon angioplasty

Annotated entities:
- Observation: "Post-procedural residual diameter stenosis"
- Condition: "lesions"
- Qualifier: "treated"
- Value: "< 20%"
- Procedure: "stent implantation"
- Procedure: "balloon angioplasty"
- Value: "< 50%"
- Condition: "lesions"
- Observation: "Post-procedural residual diameter stenosis"